Clinical trial exclusion criterion:
Diarrhea, grade 1 or greater by the National Cancer Institute Common Terminology Criteria for Adverse Events (NCI-CTCAE, version [v] 4.0)

Entity relations:
- Has_value("National Cancer Institute Common Terminology Criteria for Adverse Events", "grade 1 or greater")
- AND("Diarrhea", "National Cancer Institute Common Terminology Criteria for Adverse Events")
- Subsumes("National Cancer Institute Common Terminology Criteria for Adverse Events", "NCI-CTCAE, version [v] 4.0")